Clinical trial exclusion criterion:
Concurrent medications that affect gastrointestinal motility

Annotated entities:
- Drug: "medications"
- Condition: "gastrointestinal motility"